Clinical trial inclusion criterion:
Written informed consent

Annotated entities:
- Observation: "Written informed consent"